Untreated phaeochromocytoma.

The above is a clinical trial exclusion criterion. Annotated with entity spans:
[Qualifier: Untreated] [Condition: phaeochromocytoma].